一位 6 歲男孩至門診求診，主訴是最近 1 個月上樓梯有困難，且抬不起頭，理學檢查發現手指關節處及眼睛周圍有紅疹。下列敘述何者錯誤？
A. 肌肉酵素常有升高
B. 神經傳導檢查可見傳導速度變慢
C. 甲摺鏡檢查（nailfold microscopy）常見擴張且彎曲之微血管
D. 治療須使用類固醇及其他免疫抑制劑

正確答案：B. 神經傳導檢查可見傳導速度變慢